Clinical trial exclusion criterion:
Patients with inflammatory arthritis

Annotated entities:
- Condition: "inflammatory arthritis"